下列有關藥品吸收的敘述，何者錯誤？
A. 大部分藥品以被動運輸方式吸收
B. 離子化愈大，吸收愈大
C. 首度效應高的藥品，不宜口服
D. 由膽汁排泄之藥物，可能由腸道再吸收

正確答案：B. 離子化愈大，吸收愈大